Clasifica las proteínas y regula su tráfico hacia sus destinos celulares:
1. Aparato de Golgi.
2. Ribosomas.
3. Retículo endoplasmático rugoso.
4. Mitocondrias.
5. Lisosomas.

Respuesta correcta: 1. Aparato de Golgi.